Clinical trial exclusion criteria:
Pregnancy and lactation
Patients with diabetes, Ischemic heart disease (IHD), stroke, malignancy and psychiatric diseases are excluded from study.
The patients receiving vitamin supplements or who had clinical evidence for an acute illness, renal dysfunction, thyroid dysfunction, chronic inflammatory diseases, inborn errors of homocysteine, cobalamin or folate metabolism, or any other condition known to interfere with homocysteine metabolism will be excluded
Patients who are already involved in any other trial.
Patients not willing to fill consent/ assent form are also excluded from study.

Annotated entities:
- Condition: "Pregnancy"
- Condition: "lactation"
- Grammar_Error: "and"
- Condition: "diabetes"
- Condition: "Ischemic heart disease (IHD)"
- Condition: "stroke"
- Condition: "malignancy"
- Condition: "psychiatric diseases"
- Grammar_Error: "and"
- Drug: "vitamin supplements"
- Condition: "clinical evidence for an acute illness"
- Condition: "acute illness"
- Undefined_semantics: "clinical evidence for an acute illness"
- Condition: "renal dysfunction"
- Condition: "thyroid dysfunction"
- Condition: "chronic inflammatory diseases"
- Condition: "inborn errors of homocysteine metabolism"
- Condition: "inborn errors of folate metabolism"
- Condition: "inborn errors of cobalamin metabolism"
- Condition: "condition known to interfere with homocysteine metabolism"
- Undefined_semantics: "condition known to interfere with homocysteine metabolism"
- Non-query-able: "Patients who are already involved in any other trial."
- Post-eligibility: "Patients not willing to fill consent/ assent form are also excluded from study."
- Non-query-able: "Patients not willing to fill consent/ assent form are also excluded from study."